Where is the EpCam protein mainly located?

Epithelial cell adhesion molecule (EpCAM) is a type I transmembrane glycoprotein